Ulcerative colitis patients with moderate to severe activity who achieved a clinical remission by the first course of corticosteroids

The above is a clinical trial inclusion criterion. Annotated with entity spans:
[Condition: Ulcerative colitis] patients with [Qualifier: moderate to severe] activity who achieved a [Condition: clinical remission] [Temporal: by the first course of corticosteroids]